Research exemption requested

The above is a clinical trial exclusion criterion. Annotated with entity spans:
[Observation: Research exemption requested]